Clinical trial exclusion criterion:
Chronic diseases

Annotated entities:
- Condition: "Chronic diseases"